下列何種吸入性麻醉劑對呼吸道的刺激最大？
A. halothane
B. isoflurane
C. desflurane
D. sevoflurane

正確答案：C. desflurane